Diagnosed with Beta-Thalassemia Major and receiving regular blood transfusion and on iron chelating therapy.

The above is a clinical trial inclusion criterion. Annotated with entity spans:
Diagnosed with [Condition: Beta-Thalassemia Major] and receiving [Qualifier: regular] [Procedure: blood transfusion] and on [Procedure: iron chelating therapy].